Clinical trial inclusion criterion:
Women must not be breastfeeding

Annotated entities:
- Pregnancy_considerations: "Women must not be breastfeeding"